Clinical trial exclusion criterion:
co-morbidity: severe kidney- and/or liver disease or other gastrointestinal diseases

Annotated entities:
- Condition: "kidney disease"
- Condition: "liver disease"
- Qualifier: "severe"
- Condition: "gastrointestinal diseases"